SARS 爆發時，當時民眾的恐慌主要是由下列何種現象所造成？
A. 精神疾病
B. 社會距離
C. 認知不足，心理不確定感
D. 政府無能

正確答案：C. 認知不足，心理不確定感